Clinical trial inclusion criteria:
Age between 20 and 40
Normal menstrual cycles: 25-34 days
Oligomenorrhea/amenorrhea or polycystic syndrome (defined according to the Rotterdam criteria 2004)
BMI >18 and <35 kg/m2

Annotated entities:
- Person: "Age"
- Value: "between 20 and 40"
- Condition: "Normal menstrual cycles"
- Value: "25-34 days"
- Condition: "amenorrhea"
- Condition: "Oligomenorrhea"
- Condition: "polycystic syndrome"
- Qualifier: "Rotterdam criteria 2004"
- Measurement: "BMI"
- Value: ">18 and <35 kg/m2"